¿Cómo se denomina la distancia entre lo que un niño es capaz de hacer por sí mismo y lo que es capaz de hacer si un adulto, u otro niño más capaz, le ayuda?:
1. Andamiaje.
2. Autorregulación.
3. Reacción circular terciaria.
4. Zona de desarrollo próximo (o proximal).
5. Zona de atención compartida.

Respuesta correcta: 4. Zona de desarrollo próximo (o proximal).